Head trauma within the previous two weeks

The above is a clinical trial exclusion criterion. Annotated with entity spans:
[Condition: Head trauma] [Temporal: within the previous two weeks]